Clinical trial inclusion criterion:
Subjects over the age of 18 years who agree informed consent and who have at least one polyp of eligible size (6-10mm)

Entity relations:
- Has_value("age", "18 years over")
- Has_qualifier("polyp", "eligible size")
- Subsumes("eligible size", "6-10mm")
- Has_multiplier("polyp", "at least one")